Clinical trial inclusion criterion:
HCV RNA > 103 IU/mL at screening

Annotated entities:
- Measurement: "HCV RNA"
- Value: "> 103 IU/mL"
- Temporal: "at screening"
- Reference_point: "screening"